Indique cuál de los siguientes déficits da lugar a una porfiria:
1. Fenilalanina hidroxilasa.
2. 21 α-hidroxilasa.
3. Ferroquelatasa.
4. Glucoquinasa.
5. Tirosina hidroxilasa.

Respuesta correcta: 3. Ferroquelatasa.